Clinical trial exclusion criterion:
Active clinically significant bleeding

Annotated entities:
- Condition: "bleeding"
- Qualifier: "significant"
- Qualifier: "Active"